El galio es el elemento que está debajo del aluminio en el grupo 13 de la tabla periódica. Por ello:
1. Arde en oxígeno dando Ga2O.
2. Es estable al aire debido a una capa protectora de óxido.
3. Se disuelve muy rápidamente en ácido nítrico.
4. No es soluble en agua básica con desprendimiento de hidrógeno.
5. Tiene un punto de fusión un poco mayor que el aluminio.

Respuesta correcta: 2. Es estable al aire debido a una capa protectora de óxido.